Clinical trial exclusion criterion:
neurologic condition causing the loss of function of the finger to be treated

Entity relations:
- Has_qualifier("loss of function", "finger to be treated")
- AND("neurologic condition", "loss of function")